Clinical trial exclusion criterion:
Known renal impairment

Annotated entities:
- Condition: "renal impairment"